血清素再吸收抑制劑（SSRI）極少用來治療那種疾病？
A. 憂鬱症
B. 精神分裂症
C. 強迫症
D. 恐慌症

正確答案：B. 精神分裂症